日本腦炎病毒（Japanese encephalitis virus）藉由下列何者媒介傳播？
A. 三斑家蚊
B. 采采蠅
C. 白蛉子
D. 老鼠

正確答案：A. 三斑家蚊